Clinical trial inclusion criterion:
Completed the initial routine ante-natal examination at the clinics

Entity relations:
- AND("routine ante-natal examination", "clinics")